Smokes = 1 cigarette per day (cpd)

The above is a clinical trial inclusion criterion. Annotated with entity spans:
[Observation: Smokes] [Multiplier: = 1 cigarette per day] (cpd)